Clinical trial inclusion criterion:
Patients with a lesion > 0.5 cm in largest diameter size, initially scored BI-RADS® 3, 4a, 4b or 4c in B-mode ultrasound

Entity relations:
- Has_value("largest diameter size", "> 0.5 cm")
- Has_value("BI-RADS®", "3, 4a, 4b or 4c")
- AND("B-mode ultrasound", "BI-RADS®")
- AND("lesion", "largest diameter size")
- AND("lesion", "B-mode ultrasound")